Clinical trial exclusion criterion:
Medical conditions associated with female sexual dysfunction; cardiovascular disease, uncontrolled chronic HT (hypertension) ,DM (diabetes mellitus), History of gynecologic surgery, female gynecological cancer ( breast, ovarian, uterine, cervical)

Entity relations:
- multi("associated with female sexual dysfunction", "female sexual dysfunction")
- Has_qualifier("Medical conditions", "associated with female sexual dysfunction")
- Subsumes("HT", "hypertension")
- Subsumes("DM", "diabetes mellitus")
- Subsumes("female gynecological cancer", "breast")
- Has_qualifier("HT", "chronic")
- Has_qualifier("HT", "uncontrolled")
- Has_temporal("gynecologic surgery", "History")
- Subsumes("Medical conditions", "cardiovascular disease")
- OR("breast", "ovarian", "uterine", "cervical")
- OR("cardiovascular disease", "DM", "gynecologic surgery", "female gynecological cancer", "HT")